Borderline or Antisocial Personality Disorder.

The above is a clinical trial exclusion criterion. Annotated with entity spans:
[Condition: Borderline] or [Condition: Antisocial Personality Disorder].